Which are the uses of deep learning models in Duchenne Muscular Dystrophy?

Deep Learning of Ultrasound Imaging for Evaluating Ambulatory Function of Individuals with Duchenne Muscular Dystrophy. The results show that each deep learning model endows muscle ultrasound imaging with the ability to enable DMD evaluations. Deep learning models are used to predict muscle function in DMD patients.